66歲男性，自訴以往健康良好。2個月前發現有兩側頸部、腋下與腹股溝淋巴結腫大，經左側淋巴結切片檢查診斷為angioimmunoblastic T cell lymphoma（AITL），接受全身性化學治療，處方為標準劑量的CHOP （cyclophosphamide, adriamycin, vincristine和prednisolone）。病人於化療2週後返回門診，主訴上腹脹、排便困難及手指指尖麻木，醫師懷疑可能發生ileus。此副作用最可能由下列何種藥物引起？
A. cyclophosphamide
B. adriamycin
C. prednisolone
D. vincristine

正確答案：D. vincristine